Clinical trial exclusion criterion:
Heart failure, New York Heart Association(NYHA) III/IV or eject fraction(EF)<40%;

Annotated entities:
- Condition: "Heart failure"
- Measurement: "New York Heart Association(NYHA)"
- Value: "III/IV"
- Measurement: "eject fraction(EF)"
- Value: "<40%"